Major bleeding history within prior 2 months

The above is a clinical trial exclusion criterion. Annotated with entity spans:
[Condition: Major bleeding history] [Temporal: within prior 2 months]